Clinical trial exclusion criteria:
Immunosuppresant host
Chronic cardiovascular/pulmonary disease
Hospital acquired infection

Annotated entities:
- Condition: "Immunosuppresant host"
- Condition: "pulmonary disease"
- Condition: "cardiovascular disease"
- Temporal: "Chronic"
- Condition: "Hospital acquired infection"